Clinical trial exclusion criterion:
preexisting CNS depression, or taking regularly medication that cause CNS depression

Annotated entities:
- Condition: "CNS depression"
- Drug: "medication"
- Condition: "CNS depression"